Clinical trial exclusion criterion:
uncontrolled diabetes

Entity relations:
- Has_qualifier("diabetes", "uncontrolled")